Clinical trial inclusion criterion:
Absolute neutrophil count (ANC) greater than or equal to 1.5 x 10^9/L without growth factor use in the 2 weeks before study randomization

Entity relations:
- Subsumes("Absolute neutrophil count", "ANC")
- Has_negation("growth factor use", "without")
- Has_index("in the 2 weeks before study randomization", "study randomization")
- Has_value("Absolute neutrophil count", "greater than 1.5 x 10^9/L")
- Has_temporal("Absolute neutrophil count", "in the 2 weeks before study randomization")
- Has_temporal("growth factor use", "in the 2 weeks before study randomization")
- OR("greater than 1.5 x 10^9/L", "equal to 1.5 x 10^9/L")